Clinical trial exclusion criterion:
Persistent, unresolved NCI CTCAE v4.0 ≥ Grade 2, previous drug-related toxicity (except alopecia, erectile impotence, hot flashes, libido, neuropathy).

Annotated entities:
- Measurement: "NCI CTCAE v4.0"
- Value: "≥ Grade 2"
- Condition: "drug-related toxicity"
- Temporal: "previous"
- Condition: "alopecia"
- Negation: "except"
- Condition: "erectile impotence"
- Condition: "hot flashes"
- Condition: "libido"
- Condition: "neuropathy"